一位新生兒有餵食欠佳、昏睡、呼吸急促症狀，血液檢查發現有輕微的呼吸性鹼中毒（respiratory alkalosis）與高血氨（hyperammonemia）。家族病史分析發現屬於性聯遺傳疾病。下列尿素循環（urea cycle）中何種酵素最可能出現功能異常？
A. 尿黑酸氧化酶（homogentisate oxygenase）
B. 鳥胺酸轉胺基甲醯基酶（ornithine transcarbamoylase）
C. 胱硫醚合成酶（cystathionine β-synthase）
D. 精胺基琥珀酸酶（argininosuccinase）

正確答案：B. 鳥胺酸轉胺基甲醯基酶（ornithine transcarbamoylase）